下列何者不適合用以治療尋常性乾癬（psoriasis vulgaris）？
A. 窄波紫外線 B 光
B. 外用維生素 D 衍生物
C. 口服類固醇
D. 外用類固醇

正確答案：C. 口服類固醇